有關消化性潰瘍手術的適應症，下列何者錯誤？
A. 藥物治療無效
B. 潰瘍出血併出血性休克
C. 幽門螺旋桿菌（Helicobacter pylori）感染
D. 穿孔

正確答案：C. 幽門螺旋桿菌（Helicobacter pylori）感染